failure of current antiretroviral regimen due to:

The above is a clinical trial inclusion criterion. Annotated with entity spans:
[Condition: failure of current antiretroviral regimen] due to: